有關慢性腎臟病人貧血的敘述何者正確？
A. 貧血的原因主要是紅血球壽命縮短
B. 如果病人是腎小管間質腎炎，通常比腎絲球病變的病人較早出現貧血
C. 這些病人的貧血大多數是低色素小球型貧血（hypochromic microcytic anemia）
D. 矯正時，這些病人的血比容（hematocrit）應控制在 36-38%

正確答案：B. 如果病人是腎小管間質腎炎，通常比腎絲球病變的病人較早出現貧血